Clinical trial exclusion criterion:
Severe cognitive impairment (defined as score = 5 on the Short Portable Mental Status Questionnaire)

Annotated entities:
- Qualifier: "Severe"
- Condition: "cognitive impairment"
- Measurement: "Short Portable Mental Status Questionnaire"
- Value: "= 5"